Consenting adults (18 years and older) who agrees and consents to skin biopsy and QSART procedure

The above is a clinical trial inclusion criterion. Annotated with entity spans:
[Post-eligibility: Consenting adults (18 years and older) who agrees and consents to skin biopsy and QSART procedure]